下列維生素何者為輔 A（coenzyme A）的結構成分？
A. Pantothenic acid
B. Ascorbic acid
C. Nicotinic acid
D. Folic acid

正確答案：A. Pantothenic acid